Clinical trial exclusion criterion:
Lower limb contractures impeding range of motion necessary for ambulation

Entity relations:
- Has_mood("range of motion necessary for ambulation", "impeding")
- Has_context("Lower limb contractures", "range of motion necessary for ambulation")